一位 30 歲之初產婦懷孕 30 週時因下腹痛住院，胎心音監視器顯示胎心跳變異性正常，心跳速度正常，子宮每 4～6 分鐘收縮一次。最近幾年她曾有多次氣喘發作。結婚之後因多囊性卵巢 2 年不孕，經藥物治療（metformin），才得以懷孕。住院抽血檢查發現有輕度白血球數目增加，CRP 值顯著升高，下列何種處理方式最恰當？
A. 給予 beta-adrenergic agonist
B. 給予 beta-adrenergic agonist 及抗生素
C. 給予 atosiban（an oxytocin competitive antagonist）
D. 給予 atosiban（an oxytocin competitive antagonist）及抗生素

正確答案：D. 給予 atosiban（an oxytocin competitive antagonist）及抗生素